¿Qué aminoácidos se pueden unir a un azúcar mediante un enlace O-glucosídico?
1. Ser y Thr.
2. Cys y Ser.
3. Asn y Thr.
4. Lys e His.
5. Val y Leu.

Respuesta correcta: 1. Ser y Thr.